Clinical trial exclusion criterion:
known allergy to clopidogrel or acetylsalicylic acid precluding its administration as specified by the protocol

Entity relations:
- AND("allergy", "clopidogrel")
- OR("clopidogrel", "acetylsalicylic acid")